Stool examination for enteric pathogens including Clostridium difficile

The above is a clinical trial inclusion criterion. Annotated with entity spans:
[Procedure: Stool examination] [Qualifier: for enteric pathogens including Clostridium difficile]